Clinical trial inclusion criterion:
No response to more than one antiarrhythmic drug, or unwilling to receive long-term drug treatment.

Entity relations:
- Has_negation("response", "No")
- Has_multiplier("antiarrhythmic drug", "more than one")
- AND("response", "antiarrhythmic drug")